What histone variants play a role in the DNA damage reponse?

Mostly H2A.X, but H2A.Z and H1R have also been associated to DNA damage